下列藥物何者適於治療隅角開放型青光眼（open-angle glaucoma）？
A. atropine
B. betaxolol
C. phentolamine
D. tropicamide

正確答案：B. betaxolol